11. Any history of anaphylaxis or severe allergy resulting in angioedema; or a history of sensitivity/allergy to latex

The above is a clinical trial exclusion criterion. Annotated with entity spans:
11. Any [Temporal: history] of [Condition: anaphylaxis] or [Qualifier: severe] [Condition: allergy] resulting in [Condition: angioedema]; or a [Temporal: history] of [Condition: sensitivity]/[Condition: allergy to latex]